Clinical trial exclusion criterion:
Contraindications for spinal anesthesia (like bleeding diathesis or regional infection at site of neuroaxial block)

Entity relations:
- AND("Contraindications", "spinal anesthesia")
- Has_qualifier("bleeding diathesis", "site of neuroaxial block")
- OR("bleeding diathesis", "regional infection")